Clinical trial exclusion criterion:
Current or planned pregnancy

Entity relations:
- Has_temporal("pregnancy", "Current")
- OR("Current", "planned")